¿Cuál de los siguientes autores desarrolló un programa conductual para la prevención del cáncer basado en la existencia de un patrón de personalidad característico en estos enfermos, que combina estrategias de desensibilización con entrenamiento en habilidades sociales?:
1. Grossarth-Maticek.
2. Moorey.
3. Greer.
4. Lazarus.

Respuesta correcta: 1. Grossarth-Maticek.